Para multiplicarse, los rabdovirus entran en la célula huésped mediante:
1. Viropexia.
2. Endocitosis.
3. Despolimerización del virión como consecuencia de la interacción con el receptor celular.
4. Translocación directa.
5. Fagocitosis opsónica.

Respuesta correcta: 2. Endocitosis.